Clinical trial inclusion criteria:
Patients older than 18 years
Classification of the American Society of Anesthesiologists (ASA I-III)
No cognitive deficits
Signed informed consent prior to surgery

Annotated entities:
- Value: "older than 18"
- Person: "years"
- Measurement: "Classification of the American Society of Anesthesiologists"
- Measurement: "ASA"
- Value: "I-III"
- Negation: "No"
- Condition: "cognitive deficits"
- Informed_consent: "Signed informed consent prior to surgery"